What are the main clinical characteristics of Pendred syndrome?

Pendred syndrome is an autosomal recessive disorder characterized by congenital sensorineural deafness, goiter, and impaired iodide organification.